Clinical trial exclusion criterion:
HbA1c > 75 mmol/mol

Entity relations:
- Has_value("HbA1c", "> 75 mmol/mol")